Insulin-treated Subjects

The above is a clinical trial exclusion criterion. Annotated with entity spans:
[Drug: Insulin]-treated Subjects